下列那一條眼肌的長度最長？
A. 上直肌
B. 上斜肌
C. 下直肌
D. 下斜肌

正確答案：B. 上斜肌